Clinical trial exclusion criterion:
5. AML or antecedent MDS secondary to prior chemotherapy

Annotated entities:
- Condition: "AML"
- Condition: "MDS"
- Temporal: "antecedent"
- Temporal: "prior"
- Condition: "chemotherapy"